Severe visual impairment, which would preclude completion of the assessments and/or intervention

The above is a clinical trial exclusion criterion. Annotated with entity spans:
[Qualifier: Severe] [Condition: visual impairment], which would preclude completion of the assessments and/or intervention